Chronic usage of steroids or other immunosuppressant medication.

The above is a clinical trial exclusion criterion. Annotated with entity spans:
[Multiplier: Chronic usage] of [Drug: steroids] or other [Drug: immunosuppressant medication].